Clinical trial exclusion criterion:
Known allergy to Granisetron or local anaesthetic (heavy bupivacaine, Marcaine Spinal 0.5% Heavy, 5mg/ml, AstraZeneca ampule)

Entity relations:
- Subsumes("heavy bupivacaine", "Marcaine Spinal 0.5% Heavy")
- Has_qualifier("Marcaine Spinal 0.5% Heavy", "5mg/ml")
- Has_qualifier("Marcaine Spinal 0.5% Heavy", "AstraZeneca ampule")
- Subsumes("local anaesthetic", "heavy bupivacaine")
- AND("allergy", "Granisetron")
- OR("Granisetron", "local anaesthetic")